El antitusígeno dextrometorfano es un enantiómero del derivado O-metilado del levorfanol que pertenece a la familia estructural de:
1. 6,7-Benzomorfanos.
2. Morfinanos.
3. 4-Fenilpiperidinas.
4. Fenilpropilaminas.
5. Oripavinas.

Respuesta correcta: 2. Morfinanos.